Use of probenecid like drugs

The above is a clinical trial exclusion criterion. Annotated with entity spans:
Use of [Drug: probenecid like drugs]